Clinical trial inclusion criterion:
Patients must be either medication treatment naïve for behavioral illnesses or have no active medication treatments for at least 1 month prior to enrollment. Prohibited medications at the time of enrollment will include stimulants, benzodiazepines and THC. Prior therapy with these agents is permitted with a washout of >30 days.

Annotated entities:
- Drug: "medication"
- Condition: "behavioral illnesses"
- Negation: "naïve"
- Negation: "no"
- Qualifier: "active"
- Drug: "medication"
- Temporal: "for at least 1 month prior to enrollment"
- Drug: "benzodiazepines"
- Drug: "THC"
- Drug: "stimulants"
- Non-representable: "Patients must be either medication treatment naïve for behavioral illnesses or have no active medication treatments for at least 1 month prior to enrollment. Prohibited medications at the time of enrollment will include stimulants, benzodiazepines and THC. Prior therapy with these agents is permitted with a washout of >30 days."